contra-indication to nicotine replacement therapy

The above is a clinical trial exclusion criterion. Annotated with entity spans:
[Condition: contra-indication] to [Procedure: nicotine replacement therapy]